Clinical trial exclusion criterion:
4. Diagnosis of Omenn's syndrome or MHC class I deficiency

Annotated entities:
- Parsing_Error: "4."
- Condition: "Omenn's syndrome"
- Condition: "MHC class I deficiency"